Clinical trial exclusion criterion:
poor tolerance of or technical difficulties with performing transesophageal echocardiography

Entity relations:
- AND("poor tolerance", "transesophageal echocardiography")
- OR("poor tolerance", "technical difficulties")